Clinical trial inclusion criterion:
16. Written informed consent must be provided.

Annotated entities:
- Post-eligibility: "Written informed consent must be provided."